Clinical trial inclusion criterion:
intolerance of or allergy to ticagrelor or prasugrel

Entity relations:
- AND("intolerance", "ticagrelor")
- OR("ticagrelor", "prasugrel")
- OR("intolerance", "allergy")